Which is the genetic lesion associated with Huntington’s disease?

The genetic lesion associated with Huntington's disease is a CAG trinucleotide repeat expansion in the HD (or HTT) gene.